History of psychiatric disorders other than unipolar major depression or generalized anxiety disorder (bipolar disorder, hypomania, and dysthymia are exclusion criteria);

The above is a clinical trial exclusion criterion. Annotated with entity spans:
History of [Condition: psychiatric disorders] [Negation: other than] [Condition: unipolar major depression] or [Condition: generalized anxiety disorder] ([Condition: bipolar disorder], [Condition: hypomania], and [Condition: dysthymia] are exclusion criteria);